下列何者起自肩胛骨的喙突（coracoid process of scapula）？
A. 肱二頭肌長頭（long head of biceps brachii）
B. 肱二頭肌短頭（short head of biceps brachii）
C. 肱三頭肌長頭（long head of triceps brachii）
D. 肱三頭肌內側頭（medial head of triceps brachii）

正確答案：B. 肱二頭肌短頭（short head of biceps brachii）